Clinical trial exclusion criterion:
4. Increased risk of bradycardia on investigator clinical judgment

Annotated entities:
- Parsing_Error: "4."
- Condition: "bradycardia"
- Subjective_judgement: "investigator clinical judgment"
- Non-query-able: "Increased risk"
- Subjective_judgement: "Increased risk"
- Qualifier: "Increased risk"